經由多次訓練與學習，投籃可以百發百中，與下列何腦區最為相關？
A. hippocampus
B. basal ganglia
C. substantia nigra
D. cerebellum

正確答案：D. cerebellum